Clinical trial inclusion criterion:
Atopic dermatitis subjects who are coincident with Hanifin and Rajka diagnosis criteria

Annotated entities:
- Condition: "Atopic dermatitis"
- Measurement: "Hanifin and Rajka diagnosis criteria"